一位85歲女性病友同時罹患糖尿病、心房纖維顫動（atrial fibrillation）、消化性潰瘍、腰椎退化性關節炎、肺結核、左下肢深部靜脈栓塞（deep vein thrombosis）與黴菌泌尿道感染。使用warfarin後，雖一再增加劑量仍未能達到預期之抗凝血效果。下列何種藥物最可能與此現象相關？
A. amiodarone
B. cimetidine
C. fluconazole
D. rifampin

正確答案：D. rifampin